La viscosidad intrínseca de un polímero en disolución:
1. Es la inversa de la viscosidad relativa.
2. Es inversamente proporcional a la masa molecular del polímero.
3. Se obtiene por extrapolación de la representación gráfica de la viscosidad reducida frente a la concentración a dilución infinita.
4. No tiene unidades.

Respuesta correcta: 3. Se obtiene por extrapolación de la representación gráfica de la viscosidad reducida frente a la concentración a dilución infinita.